Active uncontrolled bleeding

The above is a clinical trial exclusion criterion. Annotated with entity spans:
[Qualifier: Active] [Qualifier: uncontrolled] [Condition: bleeding]